En términos probabilísticos, ¿qué significa obtener un error tipo I o alfa?:
1. Aceptar H0 siendo cierta.
2. Rechazar H0 siendo cierta.
3. Rechazar H0 siendo falsa.
4. No existe este tipo de error.

Respuesta correcta: 2. Rechazar H0 siendo cierta.